Undifferentiated, Anaplastic or Medullary Thyroid Cancer

The above is a clinical trial exclusion criterion. Annotated with entity spans:
[Condition: Undifferentiated], [Condition: Anaplastic] or [Condition: Medullary Thyroid Cancer]